La síntesis con éster malónico es un método importante para preparar:
1. Cetonas.
2. Aldehídos.
3. Alcoholes.
4. Amidas.
5. Ácidos.

Respuesta correcta: 5. Ácidos.